Monitored Anesthesia Care (i.e., regional anesthesia alone without plans for general anesthesia)

The above is a clinical trial exclusion criterion. Annotated with entity spans:
[Procedure: Monitored Anesthesia Care] (i.e., [Procedure: regional anesthesia] [Multiplier: alone] [Negation: without] [Mood: plans for] [Procedure: general anesthesia])